Clinical trial inclusion criterion:
Patient meets protocol criteria for diagnosis of IBS-C, abdominal pain, abdominal bloating and abdominal girth

Annotated entities:
- Qualifier: "protocol criteria"
- Condition: "IBS-C"
- Condition: "abdominal pain"
- Condition: "abdominal bloating"
- Condition: "abdominal girth"